Clinical trial exclusion criterion:
Pregnant or lactating females.

Entity relations:
- OR("Pregnant", "lactating")